有關struvite stone的敘述，下列何者錯誤？
A. 主要成分為鎂（magnesium）、磷酸鹽（phosphate）及氨鹽（ammonium）
B. 通常以鹿角結石（staghorn stone）呈現
C. 病人的尿液pH值大多高於7.2，而大量利尿無法預防struvite stone之形成
D. 多是感染性結石，主要以抗生素治療

正確答案：D. 多是感染性結石，主要以抗生素治療